Clinical trial exclusion criterion:
A biologic medicine used within the previous 6 months

Annotated entities:
- Drug: "biologic medicine"
- Temporal: "within the previous 6 months"